Clinical trial inclusion criteria:
Severe or uncontrolled infection.
Sensitive to the product or other genetically engineered biological products from Escherichia coli strains.
Mental or nervous system disorders.
Severe heart, lung and central nervous system disorders.
Pregnant or lactating women.
TBIL(total bilirubin ), ALT(alanine aminotransferase),AST(glutamic-oxalacetic transaminase) > 2.5×ULN(upper limit of normal); if it were caused by liver metastases, TBIL, ALT,AST >5×ULN.
Cr(creatinine) >1.5×ULN.

Annotated entities:
- Qualifier: "Severe"
- Qualifier: "uncontrolled"
- Condition: "infection"
- Condition: "Sensitive"
- Drug: "the product"
- Qualifier: "other"
- Drug: "genetically engineered biological products"
- Qualifier: "Escherichia coli strains"
- Condition: "Mental disorders"
- Condition: "nervous system disorders"
- Qualifier: "Severe"
- Condition: "heart disorders"
- Condition: "lung disorders"
- Condition: "entral nervous system disorders"
- Condition: "Pregnant"
- Condition: "lactating"
- Person: "women"
- Measurement: "total bilirubin"
- Measurement: "TBIL"
- Measurement: "ALT"
- Measurement: "alanine aminotransferase"
- Measurement: "AST"
- Measurement: "glutamic-oxalacetic transaminase"
- Value: "> 2.5×ULN"
- Condition: "liver metastases"
- Measurement: "TBIL"
- Measurement: "ALT"
- Measurement: "AST"
- Value: ">5×ULN"
- Measurement: "Cr"
- Measurement: "creatinine"
- Value: ">1.5×ULN"